Clinical trial exclusion criterion:
Serious suicidal tendency

Annotated entities:
- Condition: "suicidal tendency"